下列何者不是乾癬（psoriasis）常用的治療方法？
A. 外用維生素D3及其衍生物
B. 外用皮質類固醇藥劑
C. 紫外線光照治療
D. 口服皮質類固醇藥劑

正確答案：D. 口服皮質類固醇藥劑